引起猛爆性肝炎常見的原因，不包括下列何者？
A. 藥物
B. A型肝炎
C. B型肝炎
D. 熬夜

正確答案：D. 熬夜